Renal failure on dialysis

The above is a clinical trial exclusion criterion. Annotated with entity spans:
[Condition: Renal failure] on [Procedure: dialysis]